下列有關組織胺（histamine）在炎症反應的敘述，何者正確？
A. 主要來源是白血球（leukocytes）及內皮（endothelium）
B. 可經由創傷、冷或熱等損傷釋放
C. 引起微血管（capillaries）擴張及增加其滲透性
D. 與血管內皮之H2受體（H2 receptors）結合導致血管擴大

正確答案：B. 可經由創傷、冷或熱等損傷釋放